3. Have a Karnofsky performance score of 60 or higher.

The above is a clinical trial inclusion criterion. Annotated with entity spans:
3. Have a [Measurement: Karnofsky performance score] of [Value: 60 or higher].